Clinical trial inclusion criterion:
MRI showing no skip lesion

Entity relations:
- Has_negation("skip lesion", "no")
- Has_context("MRI", "skip lesion")